Clinical trial exclusion criterion:
The patient has a known hypersensitivity or contraindication to any of the following medications: Heparin, Aspirin, Clopidogrel, Cilostazol

Entity relations:
- AND("hypersensitivity", "Heparin")
- OR("Heparin", "Aspirin", "Clopidogrel", "Cilostazol")
- OR("hypersensitivity", "contraindication")